Clinical trial inclusion criterion:
Subjects must be undergoing unilateral or bilateral mastectomy with tissue expander reconstruction

Annotated entities:
- Qualifier: "unilateral"
- Qualifier: "bilateral"
- Procedure: "mastectomy"
- Procedure: "tissue expander reconstruction"
- Temporal: "undergoing"